Clinical trial inclusion criterion:
Liver biopsy within 2 years of Screening showing absence of cirrhosis

Annotated entities:
- Procedure: "Liver biopsy"
- Temporal: "within 2 years of Screening"
- Condition: "cirrhosis"
- Negation: "absence"